Clinical trial exclusion criterion:
Clinical evidence of a severe Personality Disorder, as assessed by the study psychiatrist, which would impede participation or completion of the trial.

Entity relations:
- Has_qualifier("Personality Disorder", "severe")